Clinical trial exclusion criterion:
uterine size >12 weeks.

Annotated entities:
- Measurement: "uterine size"
- Value: ">12 weeks"